En electroforesis capilar, en relación al flujo electroosmótico se puede afirmar que:
1. El perfil del flujo es parabólico.
2. El perfil del flujo es prácticamente plano y/o uniforme.
3. No se puede saber su forma y dirección.
4. El perfil del flujo siempre se invierte.
5. El perfil del flujo nunca se invierte.

Respuesta correcta: 2. El perfil del flujo es prácticamente plano y/o uniforme.